主動脈瓣狹窄的臨床表徵不包括下列何者？
A. 心絞痛
B. 昏厥（syncope）
C. 運動性氣促
D. 收縮血壓上升

正確答案：D. 收縮血壓上升